Clinical trial exclusion criterion:
Congenital uterine malformation.

Annotated entities:
- Condition: "Congenital uterine malformation"